某患者抽血檢驗 B 型肝炎病毒（hepatitis B virus）感染指標，何種抗體存在時，代表受檢者已具有對抗此病毒之免疫力？
A. IgG anti-HBs 抗體
B. IgG anti-HBe 抗體
C. IgM anti-HBc 抗體
D. IgG anti-HBc 抗體

正確答案：A. IgG anti-HBs 抗體